Clinical trial inclusion criterion:
Prostate volume = 100 cc

Annotated entities:
- Measurement: "Prostate volume"
- Value: "= 100 cc"